Clinical trial inclusion criterion:
between 18 and 75 years old

Annotated entities:
- Person: "old"
- Value: "between 18 and 75 years"